2. Cannot tolerate or comply with compression therapy.

The above is a clinical trial exclusion criterion. Annotated with entity spans:
[Parsing_Error: 2.] [Non-query-able: Cannot tolerate or comply with] [Procedure: compression therapy].